慢性積液性中耳炎最常見的致病菌是：
A. 綠膿桿菌（Pseudomonas aeruginosa）
B. 肺炎鏈球菌（Streptococcus pneumoniae）
C. 流行感冒嗜血性桿菌（Haemophilus influenzae）
D. 大腸桿菌（E. Coli）

正確答案：C. 流行感冒嗜血性桿菌（Haemophilus influenzae）